依照醫師法第11條規定，醫師非親自診察，不得施行治療、開給方劑，或交付診斷書。依照此一規定，下列那些行為是違法的？①在偏遠的山地離島，對於年老行動不便的慢性病病人，以電話問診確認病況沒有改變後，開藥給病人的家人帶回去服用 ②對於在安養中心住院的植物人病患，統一由安養院書記蒐集健保卡，一個月一次來固定替病人領藥，免得病人奔波 ③對出國旅行的慢性病病人，由家人來代為看診領藥，以免病人斷藥 ④飛機上遇到緊急醫療情形，乘客利用手機將畫面傳給在地面上的醫師，由醫師研判後下令由機上具有護理背景的空服員執行急救
A. ①②④
B. ①②③
C. 僅②③
D. 僅①③

正確答案：C. 僅②③